Clinical trial exclusion criterion:
Patients who are on cyclosporine, bosentan, or potassium sparing diuretic.

Annotated entities:
- Drug: "cyclosporine"
- Drug: "bosentan"
- Drug: "potassium sparing diuretic"